Clinical trial exclusion criterion:
Documented allergy to local anesthetic

Annotated entities:
- Condition: "allergy"
- Drug: "local anesthetic"